35 歲男性被診斷為腎臟細胞癌，手術時發現肝及胰臟有囊腫存在，患者父親也有腎臟癌病史，腦部磁振照影發現小腦部位有一腫瘤，則患者最有可能是下列那一個基因發生突變？
A. Rb
B. p53
C. VHL
D. WT-1

正確答案：C. VHL